Clinical trial exclusion criterion:
Severe autoimmune disease, e.g. lupus erythematosus, multiple sclerosis.

Annotated entities:
- Condition: "autoimmune disease"
- Qualifier: "Severe"
- Condition: "lupus erythematosus"
- Condition: "multiple sclerosis"